Clinical trial exclusion criterion:
linezolid

Annotated entities:
- Drug: "linezolid"